En la biosíntesis de proteínas:
1. Se traduce la información contenida en las dos cadenas de DNA.
2. El RNA mensajero se traduce en la dirección 5´-3´.
3. Se produce la iniciación en la secuencia del promotor.
4. Comienza con el aminoácido más abundante.
5. Comienza con diferente aminoácido según la proteína a sintetizar.

Respuesta correcta: 2. El RNA mensajero se traduce en la dirección 5´-3´.